4. Any recent, significant change in dietary or exercise habits.

The above is a clinical trial exclusion criterion. Annotated with entity spans:
[Parsing_Error: 4.] [Non-query-able: Any recent, significant change in dietary or exercise habits.]